Clinical trial inclusion criterion:
Cohort 1: Recurrent or refractory medulloblastoma in which current standard treatment approaches have failed; biopsy is not required for recurrent disease.

Annotated entities:
- Condition: "refractory medulloblastoma"
- Condition: "Recurrent medulloblastoma"
- Procedure: "standard treatment"
- Qualifier: "failed"
- Mood: "not required"